Patients with reproductive capability must agree to practice adequate contraception methods.

The above is a clinical trial inclusion criterion. Annotated with entity spans:
Patients with [Condition: reproductive capability] must agree to practice [Qualifier: adequate] [Procedure: contraception methods].